Clinical trial exclusion criterion:
Post-hysterectomy.

Entity relations:
- Has_temporal("hysterectomy", "Post")